La condensación de un alcohol y un ácido carboxílico catalizada por ácidos produce un éster y agua, y se conoce como esterificación de:
1. Chichibabin.
2. Suzuki.
3. Fischer.
4. Heck.

Respuesta correcta: 3. Fischer.